下列何者最可能導致食道遲緩不能症（achalasia）？
A. nitric oxide及vasoactive intestinal polypeptide分泌過多
B. 食道的myenteric plexus缺損
C. 會厭軟骨（epiglottis）之功能缺陷
D. 幽門狹窄（pylorostenosis）

正確答案：B. 食道的myenteric plexus缺損